Clinical trial exclusion criterion:
Clinically significant liver disease.

Annotated entities:
- Qualifier: "Clinically significant"
- Condition: "liver disease"